Clinical trial inclusion criterion:
Children receiving amoxicilline-clavulanic acid (50-90 mg/kg/day, twice daily) due to acute otitis media or acute sinusitis

Entity relations:
- Has_value("amoxicilline-clavulanic acid", "50-90 mg/kg/day")
- Has_multiplier("amoxicilline-clavulanic acid", "twice daily")
- OR("acute otitis media", "acute sinusitis")